Clinical trial exclusion criterion:
4. The subject's upper arm circumference not adequate for proper fit of the EMG monitor (less than 14cm).

Entity relations:
- Subsumes("adequate for proper fit of the EMG monitor", "less than 14cm")
- Has_negation("adequate for proper fit of the EMG monitor", "not")
- Has_qualifier("upper arm circumference", "adequate for proper fit of the EMG monitor")